下列何種免疫反應是淋巴系統（lymphoid system）的主要功能？
A. 先天性的免疫反應（innate immunity）
B. 適應性免疫反應（adaptive immunity）
C. 發炎反應（inflammation）
D. 吞噬作用（phagocytosis）

正確答案：B. 適應性免疫反應（adaptive immunity）